What is a SERM?

selective estrogen receptor modulator (SERM),